History of documented clotting/coagulation disorder

The above is a clinical trial exclusion criterion. Annotated with entity spans:
History of documented [Condition: clotting]/[Condition: coagulation disorder]